Clinical trial inclusion criterion:
4. Ulcers that extend through the epidermis but not through the muscle, tendon, or bone (Stage II or III ulcers as defined by the IAET).

Annotated entities:
- Parsing_Error: "4."
- Condition: "Ulcers"
- Qualifier: "extend through the epidermis"
- Qualifier: "extend through the muscle"
- Negation: "not"
- Value: "Stage II or III"
- Measurement: "IAET"
- Condition: "ulcers"
- Qualifier: "extend through the tendon"
- Qualifier: "extend through the bone"